下列何者具有過碘酸－雪夫氏（periodic acid-Schiff，PAS）正反應的特性？
A. 神經纖維（nerve fiber）
B. 膠原纖維（collagen fiber）
C. 彈性纖維（elastic fiber）
D. 網狀纖維（reticular fiber）

正確答案：D. 網狀纖維（reticular fiber）